Which application is the backbone of BioPAXViz?

BioPAXViz is a Cytoscape (version 3) application for the visual exploration of metabolic pathway evolution. The software is distributed under the MIT License and is accompanied by example files and data. Additional documentation is available at the aforementioned repository.